Clinical trial exclusion criterion:
Premorbid, ongoing major depression or psychosis, altered cognitive status

Annotated entities:
- Condition: "major depression"
- Condition: "psychosis"
- Condition: "altered cognitive status"
- Temporal: "ongoing"
- Qualifier: "Premorbid"